Clinical trial exclusion criterion:
Preoperative opioid use

Annotated entities:
- Temporal: "Preoperative"
- Drug: "opioid"